Clinical trial exclusion criterion:
Invasive knee treatments with hyaluronic acid infusion, corticosteroids and anaesthetics, in the target knee, up to 6 months previous to study inclusion.

Annotated entities:
- Procedure: "Invasive knee treatments"
- Drug: "hyaluronic acid"
- Procedure: "hyaluronic acid infusion"
- Drug: "corticosteroids"
- Drug: "anaesthetics"
- Reference_point: "target knee"
- Temporal: "up to 6 months previous"
- Reference_point: "study inclusion"